What is Abbreviated Injury Scale (AIS) used to determine?

The Abbreviated Injury Scale (AIS) is an objective anatomically-based injury severity scoring system that classifies each injury by body region on a 6 point scale. AIS is the system used to determine the Injury Severity Score (ISS) of the multiply injured trauma patient.

AIS CLASSIFICATIONS
The AIS classifies individual injuries by body region as follows:
AIS 1 – Minor
AIS 2 – Moderate
AIS 3 – Serious
AIS 4 – Severe
AIS 5 – Critical
AIS 6 – Maximal (currently untreatable)